體重＜2000 克之早產兒，水分之需要量約為多少 mL/Kg/day？
A. 150
B. 100
C. 50
D. 20

正確答案：A. 150